73歲女性，過去有高血壓與心律不整病史，突發左下肢無力、全身動作與說話變少，神經學檢查顯示意識正常，語言理解能力尚可，左下肢肌力下降，其它肢體肌力尚正常，臨床診斷為急性腦梗塞中風。最可能的病變血管為何？
A. 右側前大腦動脈（anterior cerebral artery）
B. 右側中大腦動脈（middle cerebral artery）
C. 右側後大腦動脈（posterior cerebral artery）
D. 基底動脈（basilar artery）

正確答案：A. 右側前大腦動脈（anterior cerebral artery）